Clinical trial inclusion criterion:
1. Present for at least 4 weeks

Annotated entities:
- Parsing_Error: "1."
- Temporal: "at least 4 weeks"
- Qualifier: "Present"